Clinical trial exclusion criterion:
Any therapeutic invasive cardiac procedure resulting in a permanent implant that is performed within 30 days of the index procedure. Examples of permanent implant would include any new heart valve. Implantation of a permanent pacemaker is excluded.

Entity relations:
- Has_qualifier("cardiac procedure", "invasive")
- Has_qualifier("cardiac procedure", "therapeutic")
- Has_index("within 30 days of the index procedure", "the index procedure")
- Subsumes("permanent implant", "heart valve")
- AND("cardiac procedure", "permanent implant")
- Has_temporal("cardiac procedure", "within 30 days of the index procedure")
- Has_negation("permanent pacemaker", "excluded")
- AND("permanent implant", "permanent pacemaker")